有一位40歲罹患思覺失調症的女性，需接受盲腸切除手術，外科醫師跟她解釋手術內容，精神科醫師評估病人完全可以理解，因此有關同意書的簽署，下列何者正確？
A. 此病人沒有簽署同意書的能力，因此需請朋友代簽
B. 此病人沒有簽署同意書的能力，因此需請家屬代簽
C. 此病人沒有簽署同意書的能力，因此需請精神科醫師代簽
D. 此病人尚有簽署同意書的能力，因此病人自己簽即可

正確答案：D. 此病人尚有簽署同意書的能力，因此病人自己簽即可